How does condensin affect the function of topoisomeraseII?

aids sister chromatid decatenation